Clinical trial exclusion criterion:
3. Previous CABG

Annotated entities:
- Parsing_Error: "3."
- Condition: "CABG"
- Temporal: "Previous"